Nicotine addiction

The above is a clinical trial exclusion criterion. Annotated with entity spans:
[Condition: Nicotine addiction]